Clinical trial exclusion criterion:
clinical evidence of current malignancy with exception of basal cell or squamous cell carcinoma of the skin, and cervical intraepithelial neoplasia (5 years prior to randomization)

Entity relations:
- Has_index("5 years prior to randomization", "randomization")
- Has_temporal("malignancy", "5 years prior to randomization")
- Has_negation("basal cell carcinoma of the skin", "exception")
- OR("basal cell carcinoma of the skin", "cervical intraepithelial neoplasia", "squamous cell carcinoma of the skin")